List the classical symptoms of the Moschcowitz syndrome (Thrombotic thrombocytopenic purpura).

The typical manifestations of Moschocowitz syndrome (Thrombotic-thrombocytopenic purpura) are:
1) thrombocytopenia, 
2) haemolysis, 
3) fever, 
4) coma and 
5) renal failure.